Clinical trial inclusion criterion:
Subject in a stable heterosexual relationship for at least 6 months. (2)

Annotated entities:
- Observation: "heterosexual relationship"
- Qualifier: "stable"
- Temporal: "at least 6 months"